El cianuro:
1. Inhibe la respiración mitocondrial pero la producción de ATP no se ve afectada.
2. Se une al hierro del citocromo a3.
3. Se une al cobre de la citocromo oxidasa.
4. Su efecto se puede revertir al aumentar la concentración de O2.

Respuesta correcta: 2. Se une al hierro del citocromo a3.